大腸桿菌（E. coli）在DNA複製過程中，延遲股（lagging strand）之合成，下列敘述何者正確？
A. 主要是由DNA聚合酶Ⅰ型負責催化反應
B. 是一種持續性的合成反應
C. 由 3'端向5' 端的方向進行合成反應
D. 需先合成岡崎片段（Okazaki fragment）

正確答案：D. 需先合成岡崎片段（Okazaki fragment）